What is the function of the protein SERT?

SERT is a Serotonin transporter.